Implanted or irremovable metal in the body (including certain tattoos and permanent make-up)

The above is a clinical trial exclusion criterion. Annotated with entity spans:
[Device: Implanted] or [Device: irremovable metal in the body] (including certain tattoos and permanent make-up)